Clinical trial inclusion criterion:
Histologically confirmed diagnosis of unresectable, recurrent, and/or metastatic high grade soft-tissue or bone sarcoma of one of the following subtypes: soft tissue sarcomas (leiomyosarcoma, poorly differentiated/de-differentiated liposarcoma, high grade pleomorphic undifferentiated sarcoma/MFH and synovial sarcoma), and bone sarcomas (Ewing sarcoma, osteosarcoma, and chondrosarcoma [de-differentiated or mesenchymal]).

Annotated entities:
- Procedure: "Histologically"
- Value: "confirmed"
- Condition: "soft-tissue sarcoma"
- Qualifier: "high grade"
- Qualifier: "metastatic"
- Temporal: "recurrent"
- Qualifier: "unresectable"
- Condition: "bone sarcoma"
- Condition: "soft tissue sarcomas"
- Condition: "leiomyosarcoma"
- Condition: "liposarcoma"
- Qualifier: "poorly differentiated"
- Qualifier: "de-differentiated"
- Condition: "sarcoma"
- Qualifier: "undifferentiated"
- Qualifier: "pleomorphic"
- Qualifier: "high grade"
- Condition: "MFH"
- Condition: "synovial sarcoma"
- Condition: "bone sarcomas"
- Condition: "Ewing sarcoma"
- Condition: "osteosarcoma"
- Condition: "chondrosarcoma"
- Qualifier: "de-differentiated"
- Qualifier: "mesenchymal"
- Grammar_Error: "and"